Clinical trial inclusion criterion:
Adults (= 18 years of age) with World Health Organization Group 2 Pulmonary Hypertension (Mean pulmonary artery pressure = 25 mmHg and pulmonary capillary wedge pressure = 15 mmHg)

Entity relations:
- Has_value("age", "= 18 years")
- Subsumes("Adults", "age")
- Has_qualifier("Pulmonary Hypertension", "World Health Organization Group 2")
- Has_value("(Mean pulmonary artery pressure", "= 25 mmHg")
- Has_value("pulmonary capillary wedge pressure", "= 15 mmHg")